下列有關肝臟血管瘤（hemangioma）之描述，何者錯誤？
A. 標誌紅血球同位素掃描（labeled red blood cell nuclide scans）可特異地檢查腫瘤影像
B. 超過 2 公分者容易變成惡性腫瘤
C. 為最常見之肝臟良性腫瘤
D. 女性病人比男性病人多

正確答案：B. 超過 2 公分者容易變成惡性腫瘤